Señale la respuesta FALSA con respecto a la bronquiolitis:
1. Se manifiesta clínicamente por tos, secreción nasal y dificultad respiratoria.
2. Es la enfermedad del tracto respiratorio inferior más frecuente en los dos primeros años de vida.
3. La lactancia materna prolongada puede actuar como un factor protector.
4. La etiología bacteriana produce síntomas más graves que la etiología vírica.
5. Se requieren medidas generales como aislamiento respiratorio, oxigenoterapia, fluidoterapia y humidificación del ambiente.

Respuesta correcta: 4. La etiología bacteriana produce síntomas más graves que la etiología vírica.